Clinical trial inclusion criterion:
Age of 18 and over, male or female;

Annotated entities:
- Person: "Age"
- Value: "18 and over"
- Person: "male"
- Person: "female"